Clinical trial inclusion criterion:
Female with a persisting pregnancy of unknown location:

Annotated entities:
- Person: "Female"
- Condition: "pregnancy"
- Qualifier: "unknown location"
- Parsing_Error: ":"